下列何種 DNA 的缺口可藉由 DNA 連接酶（ligase）所接合？
A. 5'-O-P+3'-OH
B. 5'-OH+3'-O-P
C. 5'-OH+3'-OH
D. 5'-O-P+3'-O-P

正確答案：A. 5'-O-P+3'-OH